Clinical trial inclusion criterion:
Undergoing major cardiac surgery using cardiopulmonary bypass

Entity relations:
- AND("major cardiac surgery", "cardiopulmonary bypass")